Clinical trial inclusion criterion:
Hyperglycemia (Serum glucose > 200 mg/dl)

Entity relations:
- Has_value("Serum glucose", "> 200 mg/dl")
- Subsumes("Hyperglycemia", "Serum glucose")